Como en el caso del receptor de los linfocitos B, el receptor antigénico de los linfocitos T:
1. Experimenta cambio isotípico.
2. Experimenta hipermutación somática.
3. Se produce de forma secretada.
4. Consta de dominios C y dominios V.

Respuesta correcta: 4. Consta de dominios C y dominios V.